Clinical trial inclusion criterion:
18 - 64 years old

Annotated entities:
- Value: "18 - 64 years"
- Person: "old"